Allergy or hypersensitivity to topiramate

The above is a clinical trial exclusion criterion. Annotated with entity spans:
[Condition: Allergy] or [Condition: hypersensitivity] to [Drug: topiramate]